Internal, neurologic, rheumatologic or psychiatric disease including current heavy smoking (>20 cigarettes per day)

The above is a clinical trial exclusion criterion. Annotated with entity spans:
[Condition: Internal], [Condition: neurologic], [Condition: rheumatologic] or [Condition: psychiatric disease] including current [Observation: heavy smoking] ([Multiplier: >20 cigarettes per day])